產前胎兒監測（antepartum fetal surveillance）的主要目的為何？
A. 預防胎兒死亡
B. 找出胎兒畸形
C. 測定胎兒成熟度
D. 預估胎兒性別

正確答案：A. 預防胎兒死亡